Clinical trial exclusion criterion:
Patients with a body weight < 55 kg (known or estimated)

Entity relations:
- Has_value("body weight", "< 55 kg")